Hip fracture surgery scheduled under general anesthesia

The above is a clinical trial inclusion criterion. Annotated with entity spans:
[Procedure: Hip fracture surgery] scheduled under [Procedure: general anesthesia]